Clinical trial exclusion criterion:
Conditions or pathologies supposed to alter gastric emptying times (Thyroid dysfunction, chronic renal failure, Parkinson's disease, scleroderma, amyloidosis, any gastrointestinal disease, any not cured malignancy, and any advanced psychiatric or neurological disease).

Entity relations:
- Has_qualifier("psychiatric disease", "advanced")
- Subsumes("Conditions supposed to alter gastric emptying times", "Thyroid dysfunction")
- OR("psychiatric disease", "neurological disease")
- OR("Thyroid dysfunction", "malignancy", "gastrointestinal disease", "amyloidosis", "scleroderma", "Parkinson's disease", "chronic renal failure", "psychiatric disease")
- OR("Conditions supposed to alter gastric emptying times", "pathologies supposed to alter gastric emptying times")